La diferencia de concentración de soluto dentro y fuera de la célula da origen a una presión osmótica:
1. Cuya medida permite determinar masas molares de pequeñas moléculas.
2. Debida al paso de soluto a través de la membrana celular.
3. Que corresponde a la presión que se debe aplicar para interrumpir el paso de disolvente a través de la membrana.
4. Que causa una diferencia de potencial químico del disolvente a ambos lados de la membrana.
5. Cuyo efecto es mínimo y complicado de medir.

Respuesta correcta: 3. Que corresponde a la presión que se debe aplicar para interrumpir el paso de disolvente a través de la membrana.